Patients must have been on a stable daily dose of weak opioids or strong opioids for at least 72 hours prior to the start the study and must remain at the same dosage for the duration of the study

The above is a clinical trial inclusion criterion. Annotated with entity spans:
Patients must have been on a stable daily dose of [Drug: weak opioids] or [Drug: strong opioids] for [Temporal: at least 72 hours prior to the start the study] and must remain at the same dosage for the duration of the study